細胞凋亡（apoptosis）時，最可能發生下列何種變化？
A. 各種caspases之活性被抑制
B. DNA斷裂（fragmentation）
C. 細胞體積變大後脹破
D. 引起嚴重發炎反應

正確答案：B. DNA斷裂（fragmentation）